Clinical trial exclusion criterion:
Subject is immunologically suppressed, received steroids >1 month over the past year.

Annotated entities:
- Condition: "immunologically suppressed"
- Drug: "steroids"
- Multiplier: ">1 month"
- Temporal: "over the past year"